Clinical trial exclusion criterion:
History of skin disease or hypersensitivity and repeated contact allergies.

Annotated entities:
- Condition: "skin disease"
- Condition: "hypersensitivity"
- Condition: "contact allergies"